Clinical trial inclusion criterion:
patients affected by mono-lateral symptomatic knee articular degenerative pathology with history of chronic (for at least 4 months) pain or swelling;

Entity relations:
- Has_qualifier("knee articular degenerative pathology", "symptomatic")
- Has_qualifier("knee articular degenerative pathology", "mono-lateral")
- Subsumes("chronic", "for at least 4 months")
- Has_temporal("pain", "chronic")
- OR("pain", "swelling")